Known hemoglobin <10 g/dL

The above is a clinical trial exclusion criterion. Annotated with entity spans:
Known [Measurement: hemoglobin] [Value: <10 g/dL]